Clinical trial exclusion criterion:
BMI >40 Kg/ mm

Entity relations:
- Has_value("BMI", ">40 Kg/ mm")